History of diarrhoea in 7 days prior to first dose of vaccine (defined as =3 unformed loose stools in 24 hours).

The above is a clinical trial exclusion criterion. Annotated with entity spans:
[Temporal: History] of [Condition: diarrhoea] [Temporal: in 7 days prior to first dose of vaccine] (defined as [Value: =3] [Measurement: unformed loose stools in 24 hours]).